下列何種治療氣喘的藥物其作用時間最長？
A. Salbutamol
B. Terbutaline
C. Adrenaline
D. Formoterol

正確答案：D. Formoterol